6. Patient has preexisting sphincter problems or evidence of extensive local disease in the pelvis.

The above is a clinical trial exclusion criterion. Annotated with entity spans:
6. Patient has preexisting [Condition: sphincter problems] or [Mood: evidence of] [Qualifier: extensive] [Condition: local disease in the pelvis].